Clinical trial inclusion criterion:
Constant habitual activity patterns (no deviation > 1x/wk at 30 min/session within last 3 months)

Annotated entities:
- Condition: "Constant habitual activity patterns"
- Observation: "no deviation > 1x/wk at 30 min/session within last 3 months"